苯二氮平（benzodiazepine）較巴比妥鹽（barbiturate）安全，乃巴比妥鹽藥物過量時最容易有何種現象導致生命危險？
A. 心律不穩
B. 高燒
C. 呼吸抑制
D. 血壓過高

正確答案：C. 呼吸抑制